Known HIV/AIDS.

The above is a clinical trial exclusion criterion. Annotated with entity spans:
[Condition: Known HIV]/[Condition: AIDS].